Clinical trial exclusion criterion:
Depressed kidney function and/or AKI

Annotated entities:
- Value: "Depressed"
- Measurement: "kidney function"
- Condition: "AKI"
- Condition: "Depressed kidney function"